Clinical trial inclusion criterion:
A male or female aged 61 years or above at the time of the first vaccination.

Annotated entities:
- Person: "aged"
- Value: "61 years or above"
- Person: "female"
- Person: "male"